Clinical trial inclusion criterion:
Female participants of childbearing potential must have a negative serum pregnancy test (beta human chorionic gonadotropin [beta hCG]) at the Screening visit, and a negative urine pregnancy test pre-dose on Day 1

Entity relations:
- Subsumes("serum pregnancy test", "beta human chorionic gonadotropin [beta hCG]")
- Has_value("serum pregnancy test", "negative")
- AND("childbearing potential", "serum pregnancy test")
- AND("Female", "childbearing potential")
- Has_index("at the Screening visit", "Screening visit")
- Has_value("urine pregnancy test", "negative")
- Has_index("pre-dose on Day 1", "Day 1")
- Has_temporal("urine pregnancy test", "pre-dose on Day 1")
- Has_temporal("serum pregnancy test", "at the Screening visit")
- AND("Female", "urine pregnancy test")